Según Rosalinda Alfaro-LeFevre “el pensamiento crítico es la clave para la resolución de problemas” y a partir de esta idea la autora desarrolla su significado en la aplicación del proceso enfermero. Una característica de este pensamiento es que:
1. No necesita estar basado en principios de la ciencia ni del método científico.
2. Es deliberado y dirigido a un objetivo.
3. Se basa en conjeturas.
4. Es innato.
5. No requiere de evidencias.

Respuesta correcta: 2. Es deliberado y dirigido a un objetivo.